Clinical trial exclusion criterion:
Patient with significant polymicrobial bacteraemia (that is, a Gram positive skin contaminant in one set of blood cultures is not regarded as significant polymicrobial bacteraemia).

Annotated entities:
- Condition: "bacteraemia"
- Qualifier: "polymicrobial"